兒童患者如果發生disseminated intravascular coagulation（DIC），血液檢查時，下列何者不會出現？
A. 血中D-dimer出現
B. 血中Factor V 或 Factor VIII 降低
C. 血小板（platelets）數目降低
D. 血中fibrinogen升高

正確答案：D. 血中fibrinogen升高